下列何者具開啟聲門裂（rima glottidis）之作用？
A. 環杓後肌（posterior cricoarytenoid muscle）
B. 環甲肌（cricothyroid muscle）
C. 環杓側肌（lateral cricoarytenoid muscle）
D. 甲狀舌骨肌（thyrohyoid muscle）

正確答案：A. 環杓後肌（posterior cricoarytenoid muscle）